下列何者是運動傷害造成的足踝扭傷（ankle sprain）最常見的韌帶受傷？
A. 後距腓骨（posterior talofibular）韌帶
B. 前距腓骨（anterior talofibular）韌帶
C. 側距腓骨（lateral talofibular）韌帶
D. 三角（deltoid）韌帶

正確答案：B. 前距腓骨（anterior talofibular）韌帶